有一個愛滋病篩檢工具的敏感度（sensitivity）為 82%，特異性（specificity）為 93%，假如有一個族群，其愛滋病盛行率為 3%。試問，一個篩檢結果為正的民眾沒有愛滋病的機率為何？
A. 0.27
B. 0.73
C. 0.82
D. 0.18

正確答案：B. 0.73